妥瑞氏症（Tourette's disease）需藥物治療時，其首選藥物為下列何者？
A. 三環抗憂鬱劑
B. 高效價（high-potency）抗精神病藥物
C. 鋰鹽
D. 情緒穩定劑（mood stabilizers）

正確答案：B. 高效價（high-potency）抗精神病藥物